En el diseño de fármacos, el grupo 3hidroxiisoxazol es un isóstero de:
1. Un fenol.
2. Un ácido carboxílico.
3. 1,2-diol.
4. Una oxima.

Respuesta correcta: 2. Un ácido carboxílico.